Clinical trial exclusion criterion:
Unable to weight

Annotated entities:
- Procedure: "weight"
- Condition: "Unable"